Clinical trial exclusion criterion:
Currently dependent on any substance other than cannabis, alcohol or nicotine;

Annotated entities:
- Condition: "dependent"
- Drug: "substance"
- Negation: "other than"
- Drug: "cannabis"
- Drug: "alcohol"
- Drug: "nicotine"